有關骨骼肌之敘述，下列何者錯誤？
A. 收縮力的產生是來自於肌動蛋白（actin）與肌凝蛋白（myosin）的相互作用
B. 鈣離子與 troponin-C 的結合促使肌動蛋白絲（actin filament）上的 troponin-I 移動，進而促使肌凝蛋白的結合部位暴露出來
C. H-band 位於肌肉的肌節（sarcomere）的中央
D. 在 Z-line 的兩側的 I-band 主要是由肌動蛋白所組成的

正確答案：B. 鈣離子與 troponin-C 的結合促使肌動蛋白絲（actin filament）上的 troponin-I 移動，進而促使肌凝蛋白的結合部位暴露出來